Clinical trial inclusion criterion:
Adult patient under guardianship with consent obtained and the legal guardian's authorisation obtained.

Annotated entities:
- Informed_consent: "Adult patient under guardianship with consent obtained and the legal guardian's authorisation obtained"